Adult patient (male or female) requiring emergency endotracheal intubation.

The above is a clinical trial inclusion criterion. Annotated with entity spans:
[Person: Adult] patient ([Person: male] or [Person: female]) requiring [Procedure: emergency endotracheal intubation].